Clinical trial exclusion criterion:
Co-infection with human immunodeficiency virus, hepatitis C virus, or hepatitis D virus

Annotated entities:
- Condition: "human immunodeficiency virus"
- Condition: "hepatitis C virus"
- Condition: "hepatitis D virus"